Clinical trial exclusion criterion:
Patients with significant clinical abnormalities in CNS, respiratory or cardiovascular function, which in the investigators judgement prevents participation in the study

Entity relations:
- OR("abnormalities in CNS", "abnormalities in cardiovascular function", "abnormalities in respiratory function")